Recent (within 6 weeks) or planned dental or jaw surgery (e.g. extraction, implants)

The above is a clinical trial exclusion criterion. Annotated with entity spans:
[Temporal: Recent] ([Temporal: within 6 weeks]) or [Mood: planned] [Procedure: dental] or [Procedure: jaw surgery] (e.g. [Procedure: extraction], [Procedure: implants])